後下小腦動脈（posteroinferior cerebellar artery）通常起源自：
A. 基底動脈（basilar artery）
B. 脊髓前動脈（anterior spinal artery）
C. 椎動脈（vertebral artery）
D. 大腦中動脈（middle cerebral artery）

正確答案：C. 椎動脈（vertebral artery）